Clinical trial exclusion criterion:
Conditions that may affect the compliance to the study.

Annotated entities:
- Post-eligibility: "Conditions that may affect the compliance to the study."